Clinical trial inclusion criterion:
breast cancer

Annotated entities:
- Condition: "breast cancer"